一位 30 歲男性，因急性膽囊炎在某醫學中心接受腹腔鏡膽囊切除治療，出院後一週上腹不適，但無反彈痛，輕微黃疸，被送回原醫院急診部，抽血檢查結果：白血球 15000 /mm3，血清胰臟酵素正常， AST 及 ALT 均在正常值兩倍內，血清總膽色素 2.2 mg/dL，直接型膽色素 1.5 mg/dL，經腹部超音波檢查發現肝內膽管粗細正常，但在肝臟下緣有直徑 15 公分大之無回音區，則第一時間應考慮如何處理最為恰當？
A. 此為腸道因手術穿孔，需緊急開腹手術修補
B. 此為總膽管截斷，需安排 PTCD 引流
C. 此為術後膽汁滲漏，可先電腦斷層影像導引下放置引流管先行引流
D. 此為術後膽囊管斷端滲漏，應進行手術重新將斷端夾好

正確答案：C. 此為術後膽汁滲漏，可先電腦斷層影像導引下放置引流管先行引流